Clinical trial exclusion criterion:
(relative) Contraindications for photodynamic treatment (pregnancy, porphyria, severely disturbed liver function). Pregnancy will not be routinely tested in female patients, but the possibility of pregnancy will be discussed during screening

Annotated entities:
- Condition: "Contraindications"
- Procedure: "photodynamic treatment"
- Condition: "pregnancy"
- Condition: "porphyria"
- Qualifier: "severely"
- Condition: "disturbed liver function"
- Non-representable: "Pregnancy will not be routinely tested in female patients, but the possibility of pregnancy will be discussed during screening"